All infertile women treated with intracytoplasmic sperm injection (ICSI)/Fertilization in Vitro and Embryo Transfer (FIVET)

The above is a clinical trial inclusion criterion. Annotated with entity spans:
All [Condition: infertile] [Person: women] treated with [Procedure: intracytoplasmic sperm injection (ICSI)]/[Procedure: Fertilization in Vitro and Embryo Transfer (FIVET)]